psychosomatic or psychiatric diseases requiring hospitalization during the last 12 months

The above is a clinical trial exclusion criterion. Annotated with entity spans:
[Condition: psychosomatic] or [Condition: psychiatric diseases] requiring [Visit: hospitalization] during the [Temporal: last 12 months]